下列那種藥物適合用於改善 Crohn's disease 症狀，而且作用可達 12 週？
A. Loperamide
B. Cholestyramine
C. Infliximab
D. Senna

正確答案：C. Infliximab